Patients with a history of pulmonary embolism, or untreated deep vein thrombosis within the past 6 months

The above is a clinical trial exclusion criterion. Annotated with entity spans:
Patients with a [Temporal: history] of [Condition: pulmonary embolism], or [Qualifier: untreated] [Condition: deep vein thrombosis] [Temporal: within the past 6 months]